Receipt of oral or injectable antibiotic therapy within 72 hours prior to the first blood draw

The above is a clinical trial exclusion criterion. Annotated with entity spans:
Receipt of [Qualifier: oral] or [Qualifier: injectable] [Drug: antibiotic therapy] [Temporal: within 72 hours prior to the first blood draw]